Clinical trial exclusion criterion:
Use of concomitant antimicrobials in the first 4 days after enrolment with known activity against Gram-negative bacilli (except trimethoprim/sulphamethoxazole may be continued as Pneumocystis prophylaxis).

Entity relations:
- Has_qualifier("antimicrobials", "concomitant")
- Has_temporal("antimicrobials", "first 4 days after enrolment")
- Has_index("first 4 days after enrolment", "enrolment")
- Has_context("antimicrobials", "Gram-negative bacilli")
- Has_negation("rimethoprim/sulphamethoxazole", "except")